對於胰臟炎病患手術的適應症，不包括下列何項？
A. 診斷不確定
B. 併發腹內感染
C. 無法進食
D. 腹內出血無法控制

正確答案：C. 無法進食